Clinical trial exclusion criteria:
Inability to provide informed consent or to comply with study assessments (e.g. due to cognitive impairment or geographic distance).
Age = 17.
Allergy to povidone iodine.
Any condition requiring antibiotics 14 days prior to arriving for surgery.
Patients with chronic immunosuppression (such as HIV/AIDS).
Unable to adhere to follow up schedule and treatment.
Patients scheduled to undergo revision total knee arthroplasty for infectious reasons.

Annotated entities:
- Post-eligibility: "Inability to provide informed consent or to comply with study assessments (e.g. due to cognitive impairment or geographic distance)."
- Person: "Age"
- Value: "= 17"
- Condition: "Allergy"
- Drug: "povidone iodine"
- Procedure: "antibiotics"
- Temporal: "14 days prior to arriving for surgery"
- Reference_point: "arriving for surgery"
- Procedure: "surgery"
- Condition: "immunosuppression"
- Qualifier: "chronic"
- Condition: "HIV/AIDS"
- Post-eligibility: "Unable to adhere to follow up schedule and treatment."
- Procedure: "revision total knee arthroplasty"
- Condition: "infectious reasons"